Clinical trial inclusion criterion:
M1 or M2 marrow on day 15

Entity relations:
- Has_temporal("M1 marrow", "on day 15")
- OR("M1 marrow", "M2 marrow")